Clinical trial exclusion criterion:
currently pregnant (positive pregnancy test), planning pregnancy, or lactating (women)

Entity relations:
- Has_temporal("pregnant", "currently")
- Has_value("pregnancy test", "positive")
- Has_mood("pregnancy", "planning")
- Subsumes("pregnant", "pregnancy test")
- OR("pregnant", "pregnancy", "lactating")